Clinical trial exclusion criteria:
Inability to use verbal or pictorial pain scoring scales
hypersensitivity to selective 5-HT receptor antagonists
diagnosed congenital long QT syndrome
severe hepatic impairment
pregnancy or nursing mothers

Annotated entities:
- Procedure: "pictorial pain scoring scales"
- Procedure: "verbal pain scoring scales"
- Condition: "Inability"
- Condition: "hypersensitivity"
- Drug: "selective 5-HT receptor antagonists"
- Condition: "congenital long QT syndrome"
- Condition: "hepatic impairment"
- Qualifier: "severe"
- Condition: "pregnancy"
- Condition: "nursing"